Clinical trial exclusion criterion:
Life expectancy under 6 months

Entity relations:
- Has_value("Life expectancy", "under 6 months")